Subjects with uncontrolled intercurrent illness .

The above is a clinical trial exclusion criterion. Annotated with entity spans:
[Undefined_semantics: Subjects with uncontrolled intercurrent illness] .